下列何者情況，不是復發性副甲狀腺手術的理由？
A. 血鋁高於 2 mg/dL
B. 骨疼痛、皮膚癢
C. 血鈣＞11 mg/dL，副甲狀腺素超過 1000 pg/mL
D. 骨質疏鬆密度檢查 T＜-2.5

正確答案：A. 血鋁高於 2 mg/dL